Clinical trial exclusion criterion:
On chronic treatment (i.e., two weeks or more) with any medication severely affecting oral status (e.g. participants with gingival hypertrophy caused by anti-epileptics, calcium antagonists, cyclosporine and other immunosuppressive) or bone metabolism (e.g. anticoagulant medications, long-standing steroid medications -i.e. equal or more 2.5mg of prednisolone a day taken for >3 months -, anticonvulsants, immunosuppressants).

Annotated entities:
- Procedure: "treatment"
- Temporal: "two weeks or more"
- Drug: "immunosuppressive"
- Drug: "cyclosporine"
- Drug: "calcium antagonists"
- Drug: "anti-epileptics"
- Condition: "gingival hypertrophy"
- Observation: "bone metabolism"
- Drug: "anticoagulant"
- Drug: "steroid"
- Multiplier: "equal or more 2.5mg a day"
- Drug: "prednisolone"
- Temporal: ">3 months"
- Drug: "anticonvulsants"
- Drug: "immunosuppressants"